心臟病的孕婦生產，下列何種麻醉方法最佳？
A. 局部麻醉
B. 硬脊膜外麻醉
C. 腰椎麻醉
D. 全身麻醉

正確答案：B. 硬脊膜外麻醉